Si una reacción se encuentra en equilibrio, ¿Cuál de las afirmaciones siguientes es correcta?:
1. ∆G = 0.
2. ∆G = ∆E0.
3. ∆G = ∆G0.
4. G = In Keq.

Respuesta correcta: 1. ∆G = 0.